What 2 biological processes are regulated by STAMP2 in adipocytes?

six-transmembrane protein stamp2 as a critical modulator of this integrated response system of inflammation and metabolism